El vaciamiento gástrico de un fármaco es más lento:
1. Cuando el volumen de ingesta es bajo.
2. Cuando el contenido gástrico es líquido.
3. Cuando el pH gástrico se aproxima a 2.
4. Cuando la ingesta es rica en lípidos.

Respuesta correcta: 4. Cuando la ingesta es rica en lípidos.